With a elevated post-void residual (defined as PVR > 100cc)

The above is a clinical trial exclusion criterion. Annotated with entity spans:
With a [Value: elevated] [Measurement: post-void residual] (defined as [Measurement: PVR] [Value: > 100cc])